Clinical trial exclusion criterion:
dual organ transplant

Annotated entities:
- Multiplier: "dual"
- Procedure: "organ transplant"